濾過性病毒利用細胞表面的分子當作進入接受體來選擇可感染的細胞。HIV 用 CD4 當作主要接受體， 和 CCR5 當作共同接受體。所以 HIV 主要感染下列那一種細胞？
A. 細胞毒殺性 T 細胞
B. 輔助性 T 細胞
C. 活化的 B 細胞
D. 自然殺手（NK）細胞

正確答案：B. 輔助性 T 細胞